Patient (or the legal guardian if under guardian adult patient) has signed the informed consent form.

The above is a clinical trial inclusion criterion. Annotated with entity spans:
[Informed_consent: Patient (or the legal guardian if under guardian adult patient) has signed the informed consent form].